No prior uterine scar

The above is a clinical trial inclusion criterion. Annotated with entity spans:
[Negation: No] prior [Condition: uterine scar]